Clinical trial inclusion criterion:
Body Mass Index (BMI) of 17.5 to 30.5 kg/m2; and a total body weight >50 kg (110 lbs).

Entity relations:
- Has_value("Body Mass Index (BMI)", "17.5 to 30.5 kg/m2")
- Has_value("total body weight", ">50 kg (110 lbs)")